Clinical trial exclusion criterion:
allergic history or contraindication for any drugs in trials;

Annotated entities:
- Condition: "allergic"
- Temporal: "history"
- Condition: "contraindication"
- Drug: "drugs in trials"
- Qualifier: "any"